Diagnosed or suspected malignant tumor;

The above is a clinical trial exclusion criterion. Annotated with entity spans:
[Mood: Diagnosed] or [Mood: suspected] [Condition: malignant tumor];